Clinical trial inclusion criterion:
Control: devoid of any systemic or neurological diseases

Entity relations:
- Has_negation("systemic diseases", "devoid")
- OR("systemic diseases", "neurological diseases")